20 歲男性大學生，主訴持續發燒 10 天，合併頭痛、肌肉疼痛及咽喉疼痛。家人、同學或朋友無類似症狀。身體診查有頸部和鼠蹊淋巴腺腫大及軀幹皮膚有斑丘疹。週邊血白血球 4,200/μL，白血球分類：多核型球 35%、淋巴球 45%、單核球 15%及非典型淋巴球 5%。GOT：56 U/L，GPT：60U/L，總膽紅素 （total bilirubin）：1.0 mg/dL。請問最不需要選擇下列何種檢驗？
A. HIV test（human immunodeficiency virus I & II）
B. CMV IgM（cytomegalovirus IgM）
C. EB VCA IgM（Epstein-Barr viral capsid antigen IgM）
D. measles IgM

正確答案：D. measles IgM